Fibroscan showing cirrhosis or results > 12.5 kPa

The above is a clinical trial inclusion criterion. Annotated with entity spans:
[Procedure: Fibroscan] showing [Condition: cirrhosis] or results [Value: > 12.5 kPa]